為了預防流行性感冒病毒感染，建議老人及兒童每年施打流感疫苗。需要每年施打的正確理由為何？
A. 疫苗依據前一年流行的病毒株設計，無法涵蓋新出現的突變病毒
B. 疫苗為單一病毒株，無法涵蓋引起感染的病毒
C. 疫苗無多醣成分，引起長期免疫記憶的能力差
D. 疫苗為活病毒，在身上存活的時間短

正確答案：A. 疫苗依據前一年流行的病毒株設計，無法涵蓋新出現的突變病毒